No treatment with insulin or oral agents for 6 months

The above is a clinical trial inclusion criterion. Annotated with entity spans:
[Negation: No] [Procedure: treatment] with [Drug: insulin] or [Drug: oral agents] [Temporal: for 6 months]